Clinical trial exclusion criterion:
Patients who have a history of psychotropics abuse and can not quit, or who have mental disorders;

Entity relations:
- AND("abuse", "psychotropics")
- Has_temporal("abuse", "history")
- OR("abuse", "mental disorders")